Clinical trial inclusion criterion:
Satisfying the 1987 American College of Rheumatology (ACR) criteria for RA

Annotated entities:
- Qualifier: "1987 American College of Rheumatology (ACR) criteria"
- Condition: "RA"